Serum ALT within normal limits with no history of liver disease

The above is a clinical trial inclusion criterion. Annotated with entity spans:
[Measurement: Serum ALT] [Value: within normal limits] with [Negation: no] [Temporal: history] of [Condition: liver disease]